Known hepatitis B surface antigen-positive, or known or suspected active hepatitis C infection

The above is a clinical trial exclusion criterion. Annotated with entity spans:
Known [Measurement: hepatitis B surface antigen]-[Value: positive], or known or suspected [Qualifier: active] [Condition: hepatitis C infection]